Clinical trial exclusion criterion:
Subjects who have initiated psychotherapy in the last 4 months prior to the first visit.

Entity relations:
- Has_index("in the last 4 months prior to the first visit", "first visit")
- Has_temporal("psychotherapy", "in the last 4 months prior to the first visit")